Clinical trial exclusion criterion:
Currently on the active heart transplant list

Annotated entities:
- Mood: "active heart transplant list"